Stroke or Transient Ischemic Attack (TIA) within the past 6 months or any permanent residual neurological defect

The above is a clinical trial exclusion criterion. Annotated with entity spans:
[Condition: Stroke] or [Condition: Transient Ischemic Attack (TIA)] [Temporal: within the past 6 months] or any permanent [Condition: residual neurological defect]